Clinical trial exclusion criterion:
Heparin therapy or oral anticoagulation therapy within 48 hours;

Entity relations:
- AND("therapy", "Heparin")
- Has_temporal("therapy", "within 48 hours")
- OR("therapy", "oral anticoagulation therapy")